Major neurologic developmental delay

The above is a clinical trial exclusion criterion. Annotated with entity spans:
[Condition: Major neurologic developmental delay]